Clinical trial exclusion criterion:
Other significant co-morbid disease that would prevent participation in exercise

Annotated entities:
- Condition: "co-morbid disease"
- Qualifier: "significant"
- Qualifier: "that would prevent participation in exercise"
- Undefined_semantics: "that would prevent participation in exercise"
- Subjective_judgement: "that would prevent participation in exercise"